Clinical trial inclusion criterion:
Signs of myocardial injury as indicated by elevated troponin levels

Annotated entities:
- Measurement: "troponin levels"
- Value: "elevated"
- Condition: "myocardial injury"